Clinical trial inclusion criterion:
Patients with reduced ejection fraction (= 40%) as confirmed at any time point in the patient's medical history.

Annotated entities:
- Measurement: "ejection fraction"
- Value: "= 40%"